Diagnoses of mental retardation, dementia or delirium

The above is a clinical trial exclusion criterion. Annotated with entity spans:
Diagnoses of [Condition: mental retardation], [Condition: dementia] or [Condition: delirium]